Clinical trial inclusion criterion:
Negative cardiac troponin test before the index elective PCI.

Entity relations:
- Has_index("before the index elective PCI.", "index elective PCI")
- multi("index elective PCI", "PCI")
- Has_temporal("cardiac troponin test", "before the index elective PCI.")
- Has_value("cardiac troponin test", "Negative")